Clinical trial inclusion criteria:
Children born outside the cluster, and returning more than 72 hours after the delivery
Children that the nurse evaluates to die within the next 24 hours.

Annotated entities:
- Non-query-able: "Children born outside the cluster, and returning more than 72 hours after the delivery"
- Non-query-able: "Children that the nurse evaluates to die within the next 24 hours."